Patients who previously have received a liver transplant over the last six months and within last three years.

The above is a clinical trial inclusion criterion. Annotated with entity spans:
Patients who previously have received a [Procedure: liver transplant] over the [Temporal: last six months and within last three years].